一位早產兒發生壞死性腸炎（necrotizing enterocolitis），則下列何種措施不一定需要？
A. 禁食
B. 放置胃管
C. 經靜脈注射抗生素
D. 開腹手術

正確答案：D. 開腹手術